Clinical trial inclusion criterion:
Male or female patients age 18 years or older, with relapsed or refractory sALCL who have previously received at least 1 multiagent chemotherapy

Annotated entities:
- Person: "Male"
- Person: "female"
- Person: "age"
- Value: "18 years or older"
- Condition: "sALCL"
- Qualifier: "refractory"
- Qualifier: "relapsed"
- Multiplier: "at least 1"
- Procedure: "chemotherapy"